Clinical trial exclusion criterion:
Imminent child's birth defined as cervix dilatation up to 7 centimeters

Annotated entities:
- Condition: "Imminent child's birth"
- Measurement: "cervix dilatation"
- Value: "7 centimeters"